Clinical trial inclusion criterion:
Methadone-maintained cocaine-dependent patients use between 1g to 2g a day; 1 to 3 times a week

Annotated entities:
- Drug: "Methadone"
- Condition: "cocaine-dependent"
- Multiplier: "1g to 2g a day"
- Multiplier: "1 to 3 times a week"
- Qualifier: "Methadone-maintained"